Clinical trial exclusion criterion:
contraindication to the lumbar puncture

Entity relations:
- AND("contraindication", "lumbar puncture")